Which is the primary interacting protein of BLK?

BLK activity is regulated by two interacting proteins, BANK1 and BANK2.